與第一型人類嗜 T 淋巴細胞病毒（Human T-lymphotropic virus type 1, HTLV-1）有關的癌症是：
A. 慢性骨髓性白血病（Chronic myelogenous leukemia）
B. 成人 T 細胞白血病（Adult T-cell leukemia）
C. 卡波西氏肉瘤（Kaposi's sarcoma）
D. HTLV-1 相關脊髓病變（HTLV-1 associated myelopathy）

正確答案：B. 成人 T 細胞白血病（Adult T-cell leukemia）